Subject is pregnant.

The above is a clinical trial inclusion criterion. Annotated with entity spans:
Subject is [Condition: pregnant].